Clinical trial exclusion criterion:
Patient has had previous eradication therapy of Helicobacter pylori infection.

Entity relations:
- AND("eradication therapy", "Helicobacter pylori infection")
- Has_temporal("eradication therapy", "previous")